55 歲女性電腦打字員到門診就醫，主訴拇指、食指及中指的指尖會麻（numbness），檢視其手部，發現魚際肌（thenar muscles）萎縮，請問患者手部最可能併發下列何種功能缺失？
A. 拇指彎曲困難
B. 食指彎曲困難
C. 拇指對指（opposition）困難
D. 手腕彎曲困難

正確答案：C. 拇指對指（opposition）困難